Clinical trial exclusion criteria:
Age < 20 or > 35 years.
Congenital uterine malformation.
Multifetal pregnancy.
Known major fetal structural or chromosomal abnormality.
Known allergy or contraindication (relative or absolute) to progesterone therapy.
Presence of contraindication to cervical cerclage.
Medical conditions complicating pregnancy.
Vaginal bleeding.

Annotated entities:
- Person: "Age"
- Value: "< 20"
- Value: "> 35 years"
- Condition: "Congenital uterine malformation"
- Condition: "Multifetal pregnancy"
- Condition: "chromosomal abnormality"
- Condition: "fetal structural"
- Qualifier: "major"
- Condition: "allergy"
- Condition: "contraindication"
- Qualifier: "relative"
- Qualifier: "absolute"
- Procedure: "progesterone therapy"
- Condition: "contraindication"
- Procedure: "cervical cerclage"
- Condition: "Medical conditions"
- Qualifier: "complicating pregnancy"
- Condition: "Vaginal bleeding"